Clinical trial exclusion criterion:
pregnant women in first trimester

Entity relations:
- Has_qualifier("pregnant", "first trimester")